具有緊密接合（tight junction）並形成血－睪障壁（blood-testis barrier）的細胞是：
A. 萊迪氏細胞（Leydig cell）
B. 塞托利氏細胞（Sertoli cell）
C. 管周邊細胞（peritubular cell）
D. 產精細胞（spermatogenic cell）

正確答案：B. 塞托利氏細胞（Sertoli cell）